下列子宮內那一層組織在月經期會脫落？
A. 子宮肌膜（myometrium）
B. 子宮內膜基層（stratum basale）
C. 子宮內膜功能層（stratum functionale）
D. 子宮外膜（perimetrium）

正確答案：C. 子宮內膜功能層（stratum functionale）